Clinical trial exclusion criterion:
Heart disease, kidney disease or diabetes

Annotated entities:
- Condition: "Heart disease"
- Condition: "kidney disease"
- Condition: "diabetes"